Clinical trial exclusion criterion:
9. History of malignancies related to the NK cell line, including: NK cell leukemias and T-cell large granular lymphocyte leukemias, NK-cell lymphoproliferative disease of granular lymphocytes, and NK cell lymphomas, e.g., nasal and nasal-like NK/T-cell lymphomas.

Annotated entities:
- Condition: "malignancies"
- Temporal: "History"
- Qualifier: "related to the NK cell line"
- Condition: "NK cell leukemias"
- Condition: "T-cell large granular lymphocyte leukemias"
- Grammar_Error: "and"
- Condition: "NK-cell lymphoproliferative disease of granular lymphocytes"
- Condition: "NK cell lymphomas"
- Condition: "nasal-like NK/T-cell lymphomas"
- Condition: "nasal NK/T-cell lymphomas"
- Grammar_Error: "and"
- Grammar_Error: "and"